pre- operative treatment with anti-emetics, steroids, or analgesics

The above is a clinical trial exclusion criterion. Annotated with entity spans:
[Temporal: pre- operative] [Procedure: treatment] with [Drug: anti-emetics], [Drug: steroids], or [Drug: analgesics]